下列何種減重手術術式不是單純的restrictive type surgery？
A. 可調式胃束帶手術（adjustable gastric banding（AGB））
B. 縱式胃隔間術（vertical banded gastroplasty（VBG））
C. 袖狀胃切除術（sleeve gastrectomy（SG））
D. 膽胰繞道併十二指腸反轉（biliopancreatic diversion（BPD）with duodenal switch（DS））

正確答案：D. 膽胰繞道併十二指腸反轉（biliopancreatic diversion（BPD）with duodenal switch（DS））